History or evidence of a stroke

The above is a clinical trial exclusion criterion. Annotated with entity spans:
[Temporal: History] or [Mood: evidence] of a [Condition: stroke]